下列何者所併發的栓塞（embolic complications）可在肺部微血管循環中發現鱗狀細胞（squamous cell）？
A. 分娩
B. 嚴重骨折
C. 胸壁傷害
D. 血管導管檢查

正確答案：A. 分娩